Clinical trial inclusion criterion:
residents at low altitude (<800 m)

Annotated entities:
- Non-query-able: "residents at low altitude (<800 m)"